Clinical trial exclusion criterion:
DSM-IV diagnosis of Alcohol or Substance Dependence within the last six months (except nicotine) or DSM-5 diagnosis of Substance Use Disorder in the last six months (except nicotine)

Annotated entities:
- Qualifier: "DSM-IV"
- Condition: "Alcohol Dependence"
- Condition: "Substance Dependence"
- Temporal: "within the last six months"
- Drug: "nicotine"
- Negation: "except"
- Qualifier: "DSM-5"
- Condition: "Substance Use Disorder"
- Temporal: "in the last six months"
- Drug: "nicotine"
- Negation: "except"